一位在軍中服役的 18 歲青年與其女友先後罹患嚴重的腦膜炎，兩人緊急送醫治療後，其女友雖痊癒，青年本人則不治身亡。在治療前，於自兩人所採集的腦脊髓液（cerebrospinal fluid）中發現大量胞內含菌的多型核白血球（polymorphonuclear leukocytes）。根據由腦脊髓液所分離到的細菌種類，確定兩人罹患流行性腦膜炎。下列有關此致病菌的敘述，何者錯誤？
A. 此菌經由呼吸道感染人類
B. 此菌廣泛生存於環境中
C. 此菌是一種革蘭氏陰性球菌
D. 人類是此菌唯一的天然宿主

正確答案：B. 此菌廣泛生存於環境中